Requirement of family or other caregiver support at study investigator criteria (defined as a patient's relative or caregiver (male or female) = 80 year old, who spend = 3 consecutive hours with patient, with good physical and psychological health status and without physical limitations, reading and writing educational level and able to understand and follow the study procedures).

The above is a clinical trial inclusion criterion. Annotated with entity spans:
[Non-query-able: Requirement of family or other caregiver support at study investigator criteria (defined as a patient's relative or caregiver (male or female) = 80 year old, who spend = 3 consecutive hours with patient, with good physical and psychological health status and without physical limitations, reading and writing educational level and able to understand and follow the study procedures]).